Asymptomatic women 45-68 years, residents in the Piedmont Region, attending the regional breast cancer screening program

The above is a clinical trial inclusion criterion. Annotated with entity spans:
[Qualifier: Asymptomatic] [Person: women] [Value: 45-68 years], residents in the [Visit: Piedmont Region], attending the [Procedure: regional breast cancer screening program]